Patients who require medication for more than 12 weeks due to osteoarthritis symptoms.

The above is a clinical trial inclusion criterion. Annotated with entity spans:
Patients who require [Drug: medication] for [Multiplier: more than 12 weeks] due to [Condition: osteoarthritis symptoms].